下列何者完全經由促進性擴散作用（facilitated diffusion）而吸收？
A. 果糖（fructose）
B. 半乳糖（galactose）
C. 葡萄糖（glucose）
D. 乳糖（lactose）

正確答案：A. 果糖（fructose）